Clinical trial inclusion criterion:
No chemotherapy treatment (except for Deticene used before the first T cell clones infusion) or radiotherapy or immunotherapy in the last 4 weeks before infusion.

Entity relations:
- Has_negation("Deticene", "except for")
- Has_index("before the first T cell clones infusion", "the first T cell clones infusion")
- Has_temporal("Deticene", "before the first T cell clones infusion")
- AND("chemotherapy", "Deticene")
- Has_index("in the last 4 weeks before infusion", "infusion")
- Has_temporal("chemotherapy", "in the last 4 weeks before infusion")
- Has_negation("chemotherapy", "No")
- OR("chemotherapy", "immunotherapy", "radiotherapy")